一位25歲懷孕22週婦女，被家人發現意識改變，送至急診時，已無呼吸、無脈搏，下列敘述及處置，何者錯誤？
A. 懷孕婦女急救時，必須予以左側躺（右側墊高），以減少子宮對下腔靜脈（inferior vena cava）的壓迫
B. 由於懷孕的子宮會將橫膈往上推，所以心臟按摩壓胸位置在胸骨中央偏上方處
C. 如使用電擊器去顫（Defibrillation），位置與劑量和一般成人急救是一樣的
D. 緊急剖腹產，對於22週的胎兒有存活的機會，同時也可以提升母親救活的機會

正確答案：A. 懷孕婦女急救時，必須予以左側躺（右側墊高），以減少子宮對下腔靜脈（inferior vena cava）的壓迫